Clinical trial exclusion criterion:
Medium or large sized gastric or duodenal varices

Annotated entities:
- Condition: "duodenal varices"
- Condition: "gastric c"
- Qualifier: "large"
- Qualifier: "Medium"